¿Qué ocurriría si el DNA llevara OH en el carbono 2’ de la pentosa?
1. Que en vez de timina debería llevar uracilo.
2. Que sería más sensible a la hidrólisis.
3. Que en vez de en el núcleo se encontraría en el citoplasma.
4. Que no podría formar dobles hélices.
5. Que daría un valor más elevado de absorbancia a 260 mm.

Respuesta correcta: 2. Que sería más sensible a la hidrólisis.